下列敘述，何者錯誤？
A. 營養不良會導致傷口癒合延遲
B. 傷口蓋上敷料之目的為保護傷口、防止細菌感染及吸收傷口之滲液
C. 污染傷口（contaminated wounds）最適當的治療方法是清創（debridement）後立即縫合傷口
D. 巨噬細胞（macrophages）和嗜中性粒細胞（neutrophils）是傷口癒合炎症期的主要細胞

正確答案：C. 污染傷口（contaminated wounds）最適當的治療方法是清創（debridement）後立即縫合傷口